simultaneous both sided extraction or only upper third molar extraction

The above is a clinical trial exclusion criterion. Annotated with entity spans:
[Temporal: simultaneous] [Qualifier: both sided] extraction or [Qualifier: only upper third] [Procedure: molar extraction]